Receipt of any vaccine in the 4 weeks preceding each trial vaccination or planned receipt of any vaccine in the 4 weeks following each trial vaccination, except for:

The above is a clinical trial exclusion criterion. Annotated with entity spans:
Receipt of any [Drug: vaccine] [Temporal: in the 4 weeks preceding each trial vaccination] or [Mood: planned receipt] of any [Drug: vaccine] [Temporal: in the 4 weeks following each trial vaccination], [Parsing_Error: except for:]